Admission to the intensive care unit for current pulmonary exacerbation in the two weeks prior to Visit 2, unless admission was due to a desensitization protocol

The above is a clinical trial exclusion criterion. Annotated with entity spans:
[Observation: Admission to the intensive care unit] for current [Condition: pulmonary exacerbation] [Temporal: in the two weeks prior to Visit 2], [Negation: unless] admission was due to a [Procedure: desensitization protocol]